10. Lipid lowering agents: gemfibrozil

The above is a clinical trial exclusion criterion. Annotated with entity spans:
[Parsing_Error: 10.] Lipid lowering agents: [Drug: gemfibrozil]